Clinical trial inclusion criterion:
Weight >1900g at time of delivery

Entity relations:
- Has_value("Weight", ">1900g")
- Has_temporal("Weight", "at time of delivery")